Clinical trial inclusion criterion:
Burns

Annotated entities:
- Condition: "Burns"